Clinical trial exclusion criterion:
Patient refusal

Annotated entities:
- Informed_consent: "Patient refusal"